下列第幾型乳頭瘤病毒常在子宮頸癌組織中出現？
A. 六
B. 十一
C. 十八
D. 三十六

正確答案：C. 十八